Clinical trial exclusion criterion:
renal function impairment (serum creatinine >1.5 mg/dl), Fanconi syndrome

Entity relations:
- Subsumes("renal function impairment", "serum creatinine")
- Subsumes("serum creatinine", ">1.5 mg/dl")
- Has_value("serum creatinine", ">1.5 mg/dl")